下列那一種狀況最可能造成低血鈣？
A. 急性胰臟炎
B. 維生素 D 中毒
C. 甲狀腺功能亢進
D. 長期臥床

正確答案：A. 急性胰臟炎